Chronic pancreatitis requiring pancreatoduodenectomy

The above is a clinical trial inclusion criterion. Annotated with entity spans:
[Condition: Chronic pancreatitis] [Observation: requiring] [Procedure: pancreatoduodenectomy]